Clinical trial inclusion criteria:
males and females greater than or equal to 18 years of age
current regular user of e-cigarettes (use at least once daily for the past 30 days) with nicotine strength > 6mg/ml
health medical history
abstinent from any tobacco/nicotine use for 4 hours prior to imaging

Annotated entities:
- Person: "males"
- Person: "females"
- Person: "age"
- Value: "greater than or equal to 18 years"
- Person: "user"
- Qualifier: "regular"
- Qualifier: "e-cigarettes"
- Multiplier: "at least once daily"
- Temporal: "for the past 30 days"
- Measurement: "nicotine strength"
- Value: "> 6mg/ml"
- Temporal: "medical history"
- Qualifier: "health"
- Condition: "abstinent"
- Drug: "tobacco"
- Drug: "nicotine"
- Temporal: "for 4 hours prior to imaging"
- Reference_point: "imaging"